Clinical trial exclusion criterion:
revision hip arthroplasty

Annotated entities:
- Procedure: "revision hip arthroplasty"